Clinical trial inclusion criterion:
BMI 30-42

Entity relations:
- Has_value("BMI", "30-42")